Clinical trial exclusion criterion:
patients aged>75 years.

Annotated entities:
- Person: "aged"
- Value: ">75 years"